Major surgery within 6 weeks

The above is a clinical trial exclusion criterion. Annotated with entity spans:
[Procedure: Major surgery] [Temporal: within 6 weeks]